Clinical trial exclusion criterion:
History of a severe allergic reaction (e.g. anaphylaxis) to any component of the vaccines used in the study including neomycin, yeast and polymyxin B

Entity relations:
- Has_qualifier("allergic reaction", "severe")
- Subsumes("component of the vaccines used in the study", "neomycin")
- Subsumes("allergic reaction", "anaphylaxis")
- AND("allergic reaction", "component of the vaccines used in the study")
- OR("neomycin", "yeast", "polymyxin B")